Clinical trial exclusion criterion:
Has had a thyroidectomy or active thyroid disease requiring medication during the last 12 months (not excluded: a stable thyroid supplementation)

Entity relations:
- Has_qualifier("thyroid disease", "active")
- Has_qualifier("thyroid supplementation", "stable")
- AND("thyroid disease", "medication")
- Has_temporal("medication", "during the last 12 months")
- Has_negation("thyroid supplementation", "not excluded")
- AND("thyroid disease", "thyroid supplementation")
- OR("thyroidectomy", "thyroid disease")